12歲的男童幾天前有呼吸道感染，這兩天出現眼皮浮腫，陰囊水腫。尿液檢查顯示尿蛋白>300 mg/dL, RBC 3～5/HPF, 血中白蛋白1.7 gm/dL, 醫師給予類固醇治療8週之後，再次檢測尿蛋白仍是>300mg/dL反應，且血中肌酐酸值兩個月間增加了1.2 mg/dL，下列何者最可能是男童的診斷？
A. 微小變化型腎病變（minimal change nephropathy）
B. 局部巢狀腎絲球硬化（focal segmental glomerulosclerosis）
C. 腎絲球基底膜薄膜病（thin glomerular basement membrane disease）
D. IgA腎炎（IgA nephropathy）

正確答案：B. 局部巢狀腎絲球硬化（focal segmental glomerulosclerosis）